Clinical trial exclusion criterion:
Diagnosis of primary progressive MS

Entity relations:
- Has_qualifier("progressive MS", "primary")